Clinical trial exclusion criterion:
metabolically unstable

Annotated entities:
- Condition: "metabolically unstable"